Patients with systemic, rheumatic or inflammatory disease of the knee or chondrocalcinosis, hemochromatosis, inflammatory arthritis, arthropathy of the knee associated with juxta-articular Paget's disease of the femur or tibia, hemophilic arthropathy, infectious arthritis, Charcot's knee joint, villonodular synovitis, and synovial chondromatosis

The above is a clinical trial exclusion criterion. Annotated with entity spans:
Patients with [Condition: systemic], [Condition: rheumatic] or [Condition: inflammatory disease] of the [Qualifier: knee] or [Condition: chondrocalcinosis], [Condition: hemochromatosis], [Condition: inflammatory arthritis], [Condition: arthropathy of the knee] associated with [Qualifier: juxta-articular] [Condition: Paget's disease] of the [Qualifier: femur] or [Qualifier: tibia], [Condition: hemophilic arthropathy], [Condition: infectious arthritis], [Condition: Charcot's knee joint], [Condition: villonodular synovitis], [Parsing_Error: and] [Condition: synovial chondromatosis]